Clinical trial exclusion criterion:
Eczema, history of eczema, exfoliative skin conditions, wounds, burns, or other skin conditions at the investigator's discretion.

Annotated entities:
- Condition: "Eczema"
- Temporal: "history of eczema"
- Condition: "exfoliative skin conditions"
- Condition: "wounds"
- Condition: "burns"
- Condition: "other skin conditions"
- Subjective_judgement: "at the investigator's discretion"